Clinical trial exclusion criterion:
concomitant biofeedback

Annotated entities:
- Temporal: "concomitant"
- Procedure: "biofeedback"